Any previous treatments for active CSC;

The above is a clinical trial exclusion criterion. Annotated with entity spans:
Any [Temporal: previous] [Procedure: treatments] for [Qualifier: active] [Condition: CSC];